Clinical trial inclusion criterion:
age greater than 18 years old

Entity relations:
- Has_value("age", "greater than 18 years old")